Patients with other interventions planned prior to the end of the study period (orthosis, surgery etc.).

The above is a clinical trial exclusion criterion. Annotated with entity spans:
[Non-query-able: Patients with other interventions planned prior to the end of the study period (orthosis, surgery etc.)].